Have sickle cell disease (confirmed by Hb electrophoresis or more specific tests) or other conditions with iron overload from repeated blood transfusions (see exclusion criteria for exceptions);

The above is a clinical trial inclusion criterion. Annotated with entity spans:
Have [Condition: sickle cell disease] (confirmed by [Procedure: Hb electrophoresis] or [Procedure: more specific tests]) or [Condition: other conditions with iron overload] from [Multiplier: repeated] [Procedure: blood transfusions] (see exclusion criteria for exceptions);